Clinical trial inclusion criterion:
Age between 18 and 80 years.

Annotated entities:
- Person: "Age"
- Value: "between 18 and 80 years"